severe concurrent disease,

The above is a clinical trial inclusion criterion. Annotated with entity spans:
[Qualifier: severe] [Temporal: concurrent] [Condition: disease],